一位 45 歲婦人主訴食慾不振，腹部不適及皮膚發黃，實驗室檢查數據如下：prothrombin time 延長， alkaline phosphatase（ALP）350 U/L，GGT 280 U/L，ALT 60 U/L，AST 50 U/L，total bilirubin 7.0 mg/dL， direct bilirubin 4.2 mg/dL。下列何項步驟或敘述最不恰當？
A. 應予病患補充維他命 K
B. 病患應先接受腹部超音波檢查
C. 病患應立即進行經皮穿膽管引流術（PTCD）
D. 病患之尿液膽紅素（bilirubin）會增加，而糞便黃疸色素原（urobilinogen）會減少

正確答案：C. 病患應立即進行經皮穿膽管引流術（PTCD）